處理污染傷口（contaminated wound）時，下列何者被認為是最重要的一個方法？
A. 細菌培養及抗生素的使用
B. 壞死組織之清創
C. 每四小時更換生理食鹽水紗布（wet dressing）
D. 儘早關閉傷口，必要時植皮

正確答案：B. 壞死組織之清創